Clinical trial exclusion criterion:
Known intolerance to one of the two drugs.

Entity relations:
- Has_multiplier("drugs", "one of the two")
- AND("intolerance", "drugs")